20 個月大之男嬰因連續 3 天的腹瀉及嘔吐住院。理學檢查顯示病人對刺激無反應，上臂及小腿偶見抽搐 （twitching）現象。評估其脫水程度為 10%，血清電解質檢查結果 Na+：114 mEq/L；Cl- ：82 mEq/L； HCO3- ：15 mEq/L，BUN 43 mg/dL。隨機選取尿液檢查顯示比重為 1.021，Na+：12 mEq/L。對此病人最佳的立即處置應為：
A. 給予利尿劑 furosemide 2 mg/kg 以排水增加細胞外滲透壓
B. 靜脈注射 0.45% saline in glucose 連續 12 小時
C. 靜脈注射 3% saline 使血鈉濃度呈 1-2 mEq/小時速率增加，連續 8 小時
D. 靜脈注射 phenobarbital 先控制抽搐，再靜注 0.6 % NaCl

正確答案：C. 靜脈注射 3% saline 使血鈉濃度呈 1-2 mEq/小時速率增加，連續 8 小時